Hepatic function, as follows: Aspartate aminotransferase (AST) <=3 x ULN, Alanine aminotransferase (ALT) <=3 x ULN, Total Bilirubin <=1.5 x ULN.

The above is a clinical trial inclusion criterion. Annotated with entity spans:
Hepatic function, as follows: A[Measurement: spartate aminotransferase (AST)] [Value: <=3 x ULN], [Measurement: Alanine aminotransferase (ALT)] [Value: <=3 x ULN], [Measurement: Total Bilirubin] [Value: <=1.5 x ULN].